Clinical trial exclusion criterion:
Corrected visual acuity < 20/70; Color blindness.

Entity relations:
- Has_qualifier("visual acuity", "Corrected")
- Has_value("visual acuity", "< 20/70;")
- OR("visual acuity", "Color blindness")